Clinical trial exclusion criteria:
Previous treatment with anti-VEGF drugs or corticosteroid or grid laser photocoagulation (study eye)
History of vitrectomy surgery, submacular surgery, or other surgical intervention for RVO
Ocular disorders in the study eye that may confound interpretation of study results
BCVA over 77 letters between screening and Day 0
The pregnant or lactating woman

Annotated entities:
- Drug: "anti-VEGF drugs"
- Drug: "corticosteroid"
- Procedure: "grid laser photocoagulation ("
- Procedure: "vitrectomy surgery"
- Procedure: "submacular surgery"
- Procedure: "surgical intervention"
- Condition: "RVO"
- Non-query-able: "Ocular disorders in the study eye that may confound interpretation of study results"
- Measurement: "BCVA"
- Value: "over 77 letters"
- Pregnancy_considerations: "The pregnant or lactating woman"